Los secaderos de lecho fluido están recomendados para sustancias:
1. Con elevado calor de fusión.
2. De flujo libre.
3. Termolábiles.
4. Insolubles.
5. Permeables a la humedad.

Respuesta correcta: 3. Termolábiles.